En las separaciones cromatográficas en fase normal se utiliza:
1. Una fase móvil mixta de la misma polaridad que la fase estacionaria.
2. Una fase móvil más polar que la fase estacionaria.
3. Una fase móvil menos polar que la fase estacionaria.
4. Una fase móvil mixta más polar que la fase estacionaria.

Respuesta correcta: 3. Una fase móvil menos polar que la fase estacionaria.